Age: 18 to75 years old;

The above is a clinical trial inclusion criterion. Annotated with entity spans:
[Person: Age]: [Value: 18 to75 years old];